Clinical trial inclusion criterion:
Patients who require a central venous line to receive PN or already have a central venous line in place for other reasons

Entity relations:
- AND("central venous line", "PN")
- Has_context("central venous line", "other reasons")
- OR("central venous line", "central venous line")